Fetal weight estimation > 4500 g (clinical or ultrasonic)

The above is a clinical trial exclusion criterion. Annotated with entity spans:
[Measurement: Fetal weight estimation] [Value: > 4500 g] ([Qualifier: clinical] or [Procedure: ultrasonic])